Clinical trial inclusion criterion:
Taking methotrexate without adequate control of symptoms

Entity relations:
- Has_negation("adequate control of symptoms", "without")